Clinical trial exclusion criterion:
Has or is suspected of having an allergy to study treatments or its/their excipients, to opioids/opiates, muscle relaxants or their excipients, or other medication(s) used during general anesthesia.

Annotated entities:
- Condition: "allergy"
- Procedure: "study treatments"
- Drug: "opioids"
- Drug: "opiates"
- Drug: "muscle relaxants"
- Drug: "excipients"
- Drug: "medication"
- Qualifier: "other"
- Procedure: "general anesthesia"
- Temporal: "during general anesthesia"
- Drug: "excipients"